Which cells are affected in radiation-induced leukemias?

Hemopoietic stem cells, the possible target cells for radiation-induced leukemias.